Clinical trial inclusion criteria:
Provision of informed consent prior to any study specific procedures;
Men and women 18 years and older;
Group I PAH, defined as a mPAP=25mmHg, PCWP<15mmHg and PVR[The PVR =(mPAP-PCWP)/CO]>3.0 Woods unit.

Annotated entities:
- Non-query-able: "Provision of informed consent prior to any study specific procedures;"
- Person: "Men"
- Person: "women"
- Value: "18 years and older"
- Person: "years"
- Qualifier: "Group I"
- Condition: "PAH"
- Measurement: "mPAP"
- Value: "=25mmHg"
- Measurement: "PCWP"
- Value: "<15mmHg"
- Measurement: "PVR"
- Measurement: "(mPAP-PCWP)/CO"
- Value: ">3.0 Woods unit"